Subject declines participation

The above is a clinical trial exclusion criterion. Annotated with entity spans:
[Informed_consent: Subject declines participation]